關節孢子（arthroconidia）是下列何種黴菌之鑑定特徵？
A. Coccidioides immitis
B. Fusarium solani
C. Histoplasma capsulatum
D. Malassezia furfur

正確答案：A. Coccidioides immitis